Clinical trial inclusion criteria:
Women subjected to ICSI through controlled ovarian hyperstimulation (COH) with pituitary downregulation by GnRHa.

Annotated entities:
- Procedure: "ICSI"
- Person: "Women"
- Procedure: "controlled ovarian hyperstimulation (COH)"
- Procedure: "pituitary downregulation by GnRHa"